Need for intravenous fluid therapy

The above is a clinical trial inclusion criterion. Annotated with entity spans:
[Mood: Need for] [Procedure: intravenous fluid therapy]